Clinical trial exclusion criterion:
serum phosphorus <2.2mg/dl, osteoporosis

Entity relations:
- Has_value("serum phosphorus", "<2.2mg/dl")